What is the function of caspases?

Caspases are intracellular proteases that propagate programmed cell death, proliferation, and inflammation.